The patient is pregnant or breastfeeding

The above is a clinical trial exclusion criterion. Annotated with entity spans:
[Pregnancy_considerations: The patient is pregnant or breastfeeding]